¿Cuál de las siguientes coenzimas es necesaria para la reacción catalizada por la enzima αcetoglutarato deshidrogenasa?:
1. Tiamina pirofosfato (TPP).
2. Ácido fólico.
3. Flavín mononucleótido (FMN).
4. Biotina.

Respuesta correcta: 1. Tiamina pirofosfato (TPP).